Clinical trial exclusion criterion:
AIDS;

Annotated entities:
- Condition: "AIDS"